Clinical trial exclusion criterion:
daily chronic opioid use (over 3 months of continuous opioid use)

Annotated entities:
- Drug: "opioid"
- Qualifier: "chronic"
- Temporal: "over 3 months"